根據美國嬰兒聽力聯合委員會（Joint Committee on Infant Hearing）之意見，下列何種嬰兒為聽力障礙之高危險族群？
A. 所有嬰兒
B. 所有早產兒
C. 黃疸需要照光者
D. 罹患化膿性腦膜炎者

正確答案：D. 罹患化膿性腦膜炎者